有關慢性腎臟病-礦物質骨病變（chronic kidney disease-mineral bone disorder）的鈣磷異常，下列敘述何者錯誤？
A. 腎絲球過濾率下降會使尿磷排出減少，進而促進副甲狀腺素（PTH）和纖維母細胞生長因子23（fibroblast growth factor 23, FGF-23）生成
B. 纖維母細胞生長因子23（FGF-23）增加，會抑制活性維他命D3生成，促進低血鈣
C. 纖維母細胞生長因子23（FGF-23）會刺激副甲狀腺素生成
D. 血清纖維母細胞生長因子23（FGF-23）值過高，與慢性腎臟病病患的死亡率有正相關

正確答案：C. 纖維母細胞生長因子23（FGF-23）會刺激副甲狀腺素生成